Es una proteína alostérica:
1. Siempre existe cooperatividad.
2. Los efectores alostéricos compiten por el sitio de la unión al ligando.
3. Puede haber cooperatividad, si el alosterismo es homotrópico.
4. Todos los sitios de unión de ligandos son equivalentes e independientes.

Respuesta correcta: 3. Puede haber cooperatividad, si el alosterismo es homotrópico.